Subjects with a history of significant metabolic, cardiac, congestive heart failure, cerebrovascular, hematological, pulmonary, gastrointestinal, liver, renal, or endocrine disease or cancer that in the investigator's opinion would interfere with or alter the outcome measures, or impact subject safety.

The above is a clinical trial exclusion criterion. Annotated with entity spans:
Subjects with a [Temporal: history] of [Qualifier: significant] [Qualifier: metabolic], [Qualifier: cardiac], [Condition: congestive heart failure], [Qualifier: cerebrovascular], [Qualifier: hematological], [Qualifier: pulmonary], [Qualifier: gastrointestinal], [Qualifier: liver], [Qualifier: renal], or [Qualifier: endocrine] [Condition: disease] or [Condition: cancer] [Non-query-able: that in the investigator's opinion would interfere with or alter the outcome measures, or impact subject safety.]